Have other metallic artifacts/components in body that may interact with MRI

The above is a clinical trial exclusion criterion. Annotated with entity spans:
Have other [Device: metallic artifacts]/components in body that may [Condition: interact] with [Procedure: MRI]